台灣的 HIV 感染病人在近 2～3 年的個案急速劇增，下列相關的敘述，何者錯誤？
A. 世界衛生組織對愛滋病（AIDS）的定義是 HIV 陽性病人周邊血液 CD4+ T cell count＜400/mm3或有合併伺機性感染
B. 愛滋病病毒是反轉錄 RNA 病毒（Retrovirus）
C. 愛滋病病人的巨細胞病毒（CMV）之感染最常以視網膜炎來表現
D. 傳染途徑以血液及體液為主，台灣最近是以藥癮者共用針具相互傳染最多

正確答案：A. 世界衛生組織對愛滋病（AIDS）的定義是 HIV 陽性病人周邊血液 CD4+ T cell count＜400/mm3或有合併伺機性感染